Clinical trial inclusion criteria:
obese : weight for height > median + 3 standard deviations
simple obesity

Annotated entities:
- Condition: "obese"
- Measurement: "weight for height"
- Value: "> median + 3 standard deviations"
- Condition: "simple obesity"